Clinical trial inclusion criterion:
Failed previous fusion

Entity relations:
- Has_temporal("fusion", "previous")
- Has_qualifier("fusion", "Failed")